Clinical trial inclusion criterion:
Patients who have normal liver function and renal function.

Annotated entities:
- Qualifier: "normal"
- Condition: "liver function"
- Condition: "renal function"